Clinical trial exclusion criterion:
previous repair of pectus excavatum by any technique

Annotated entities:
- Procedure: "repair of pectus excavatum"
- Temporal: "previous"